根據波士頓失語症分類系統（Boston classification system of aphasia），下列有關威尼克氏失語症  （Wernicke's aphasia）的敘述，何者最正確？
A. 語言流暢度（fluency）受損
B. 語言理解力（comprehension）受損
C. 合併聽力失常（hearing impairment）
D. 合併命名不能（anomia）

正確答案：B. 語言理解力（comprehension）受損